2. Myocardial infarction or unstable angina within 6 months prior to Day 1 of the study.

The above is a clinical trial exclusion criterion. Annotated with entity spans:
[Parsing_Error: 2.] [Condition: Myocardial infarction] or [Condition: unstable angina] [Temporal: within 6 months prior to Day 1 of the study].